一位62歲女性乳癌病人，因化學治療後產生嗜中性白血球低下發燒（neutropenic fever）住院。後來血液培養培養出綠膿桿菌（Pseudomonas aeruginosa），選用何者抗生素治療最適當？
A. cefazolin（屬第一代頭孢菌素類抗生素Cephalosporins）
B. cefuroxime（屬第二代頭孢菌素類抗生素Cephalosporins）
C. ceftazidime（屬第三代頭孢菌素類抗生素Cephalosporins）
D. ceftriaxone（屬第三代頭孢菌素類抗生素Cephalosporins）

正確答案：C. ceftazidime（屬第三代頭孢菌素類抗生素Cephalosporins）